Primary B-NHL, PTCL (ALK+ anaplastic large cell lymphoma and NK(natural killer cell )/T cell lymphoma were excluded) or HL patients confirmed by histopathology;

The above is a clinical trial inclusion criterion. Annotated with entity spans:
[Condition: Primary B-NHL], [Condition: PTCL] ([Condition: ALK+ anaplastic large cell lymphoma and NK(natural killer cell )/T cell lymphoma] were [Negation: excluded]) or [Condition: HL] patients confirmed by histopathology;